15. Females of childbearing potential and sexually mature males must agree to use a medically accepted method of contraception throughout the study.

The above is a clinical trial inclusion criterion. Annotated with entity spans:
15. [Pregnancy_considerations: Females of childbearing potential and sexually mature males must agree to use a medically accepted method of contraception throughout the study.]